Clinical trial exclusion criterion:
Comorbidities that can be associated with elevated natriuretic peptide (NP) levels: renal insufficiency, (eGFR < 25 ml/min/1.73 m² calculated according to MDRD formula), recent (less than 3 months) cerebral trauma or recent (less than 3 months) cerebrovascular incident, novel diagnosis or acute exacerbation of COPD within the last 3 months.

Entity relations:
- Subsumes("natriuretic peptide levels", "NP")
- Has_value("natriuretic peptide levels", "elevated")
- AND("Comorbidities", "natriuretic peptide levels")
- Has_value("eGFR", "< 25 ml/min/1.73 m²")
- AND("renal insufficiency", "eGFR")
- Has_temporal("cerebral trauma", "less than 3 months")
- Has_temporal("cerebrovascular incident", "less than 3 months")
- Has_temporal("acute exacerbation of COPD", "last 3 months")
- Subsumes("Comorbidities", "cerebral trauma")
- OR("renal insufficiency", "cerebral trauma", "cerebrovascular incident", "acute exacerbation of COPD")